Chronic Kidney Disease (CKD)

The above is a clinical trial exclusion criterion. Annotated with entity spans:
[Condition: Chronic Kidney Disease (CKD)]